HFpEF: prior history of LVEF below 50%, acute decompensated HF, moderate or greater valvular disease, significant cardiac arrhythmias, pericardial disease, congenital heart disease, primary pulmonary hypertension

The above is a clinical trial exclusion criterion. Annotated with entity spans:
[Condition: HFpEF]: [Temporal: prior history of] [Measurement: LVEF] [Value: below 50%], [Qualifier: acute] [Condition: decompensated HF], [Qualifier: moderate] or [Qualifier: greater] [Condition: valvular disease], [Qualifier: significant] [Condition: cardiac arrhythmias], [Condition: pericardial disease], [Condition: congenital heart disease], [Condition: primary pulmonary hypertension]